Clinical trial exclusion criterion:
Patients with genetic problems such as galactose intolerance, Lapp lactase deficiency or glucose-galactose malabsorption, since this study drug contains lactose

Entity relations:
- Subsumes("genetic problems", "galactose intolerance")
- OR("galactose intolerance", "Lapp lactase deficiency", "glucose-galactose malabsorption")